Clinical trial exclusion criterion:
Subjects legal or mentally disabled to give an informed consent for participating on this study

Entity relations:
- OR("legal disabled", "mentally disabled")